下列何者不會影響 CVP 測量循環血量之正確性？
A. 病人個別之差異
B. 慢性肺氣腫
C. 二尖瓣閉鎖不全
D. 三尖瓣狹窄

正確答案：C. 二尖瓣閉鎖不全